有關糖尿病多發性神經病變之敘述，下列何者錯誤？
A. 糖尿病是造成多發性神經病變最常見原因
B. 最常見表現為慢性、漸進性且對稱侵犯遠端下肢足部感覺神經系統為主
C. 病患常主訴足部及下肢麻、刺痛（tingling）
D. 足部潰爛相當罕見

正確答案：D. 足部潰爛相當罕見